Los conos de la retina:
1. Poseen mayor sensibilidad a la luz que los bastones.
2. Se distribuyen homogéneamente en la retina.
3. Proporcionan elevada agudeza visual.
4. Tienen un único tipo de opsina.

Respuesta correcta: 3. Proporcionan elevada agudeza visual.